Clinical trial inclusion criterion:
Normal uterine cavity (as assessed by hysteroscopy or HSG).

Annotated entities:
- Observation: "uterine cavity"
- Value: "Normal"
- Procedure: "hysteroscopy"
- Procedure: "HSG"